一位兩個月大的孩童，自出生後即被發現在右側胸鎖乳突肌之下三分之一處的前緣有一小孔，會流出透明黏液，最可能的診斷為：
A. 第一對鰓裂瘻管（branchial cleft fistula）
B. 第二對鰓裂瘻管（branchial cleft fistula）
C. 第三對鰓裂瘻管（branchial cleft fistula）
D. 第四對鰓裂瘻管（branchial cleft fistula）

正確答案：B. 第二對鰓裂瘻管（branchial cleft fistula）